Con respecto a la administración intermitente de nutrición enteral, señale la respuesta INCORRECTA:
1. Se puede administrar en bolus.
2. La administración ha de durar de 15 a 20 minutos.
3. Terminada la toma, hay que lavar la sonda para eliminar restos.
4. Se administra siempre con bomba.
5. La cantidad total se reparte en 4 o 5 tomas diarias.

Respuesta correcta: 4. Se administra siempre con bomba.